Clinical trial inclusion criterion:
Eligibility to immediate-release MPH (IR-MPH) treatment

Annotated entities:
- Mood: "Eligibility"
- Drug: "immediate-release MPH (IR-MPH)"